65 歲男性因快速腎功能變壞及少尿（oliguria）來就醫。檢查發現高血鈣、頭骨局部溶骨性病變（skull osteolytic lesion）以及骨髓含有不正常漿細胞（abnormal plasma cells＞40%）。腎病理檢查最可能的 發現是：
A. glomerular crescent formation
B. segmental glomerular necrosis
C. diffuse tubular dilation and pigmented casts
D. fragile tubular casts surrounded by giant cells

正確答案：D. fragile tubular casts surrounded by giant cells